Children aging between 3 and 6 years

The above is a clinical trial inclusion criterion. Annotated with entity spans:
[Person: Children] [Person: aging] [Value: between 3 and 6 years]